Women of childbearing potential must agree to abstain from sexual relations that could result in pregnancy or use an effective method of birth control acceptable to both participant and the clinician prescriber during the study. Men are not required to use contraception during the study.

The above is a clinical trial inclusion criterion. Annotated with entity spans:
[Pregnancy_considerations: Women of childbearing potential must agree to abstain from sexual relations that could result in pregnancy or use an effective method of birth control acceptable to both participant and the clinician prescriber during the study. Men are not required to use contraception during the study.]